Una mujer de 56 años presenta, tras caída casual al suelo, dolor, deformidad y aumento de volumen en el brazo izquerdo, con imposibilidad para la flexión dorsal de la mano. ¿Cuál es el diagnóstico más probable?
1. Fractura de troquíter en húmero izquierdo.
2. Fractura diafisaria de húmero izquierdo con lesión del nervio radial.
3. Fractura supraintercondílea de paleta humeral con lesión del nervio mediano.
4. Fractura de cuello anatómico de húmero con lesión del nervio radial.
5. Fractura de epitróclea desplazada con lesión del nervio cubital.

Respuesta correcta: 2. Fractura diafisaria de húmero izquierdo con lesión del nervio radial.